Clinical trial exclusion criterion:
Asthma

Annotated entities:
- Condition: "Asthma"